Clinical trial inclusion criterion:
Hemoglobin (hgb) greater than or equal to 10 g/dL without transfusional support or growth factor use in the 4 weeks before study randomization

Annotated entities:
- Measurement: "Hemoglobin"
- Measurement: "hgb"
- Value: "equal to 10 g/dL"
- Value: "greater than 10 g/dL"
- Temporal: "in the 4 weeks before study randomization"
- Reference_point: "study randomization"
- Negation: "without"
- Observation: "transfusional support"
- Observation: "growth factor use"